Clinical trial exclusion criterion:
Endoscopic insertion of video capsule endoscope

Annotated entities:
- Procedure: "Endoscopic insertion"
- Device: "video capsule endoscope"